臨床常見膽囊切除的適應症中，下列何者錯誤？
A. 膽囊息肉（polyp）>10 mm
B. 無症狀單顆膽結石>2 cm
C. 急性無膽結石性膽囊炎（acute acalculous cholecystitis）
D. 有症狀之膽結石（symptomatic cholelithiasis）

正確答案：B. 無症狀單顆膽結石>2 cm